下列何者最易導致糞脂症（steatorrhea）？
A. 胃分泌過多脂肪酶（lipase）
B. 十二指腸內 pH 值偏鹼
C. 胰臟脂肪酶（lipase）分泌不足
D. 胃部分切除（partial gastrectomy）手術後

正確答案：C. 胰臟脂肪酶（lipase）分泌不足